Clinical trial exclusion criterion:
child has a history of a condition that requires a beta blocker medicine for cardiac conditions, high blood pressure, migraine headaches, or eye drops for glaucoma (e.g. propranolol, metoprolol, atenolol and Timoptic®, or Betoptic® eye drops).

Annotated entities:
- Drug: "beta blocker medicine"
- Condition: "cardiac conditions"
- Condition: "high blood pressure"
- Condition: "migraine headaches"
- Condition: "glaucoma"
- Drug: "eye drops"
- Drug: "propranolol"
- Drug: "metoprolol"
- Drug: "atenolol"
- Drug: "Timoptic"
- Drug: "Betoptic"
- Drug: "eye drops"